Clinical trial inclusion criterion:
Two or more relapses in the previous year, whether on DMD treatment or not.

Entity relations:
- Has_temporal("relapses", "in the previous year")
- Has_multiplier("relapses", "Two or more")